有關前置胎盤，最典型的症狀為何？
A. 不正常的胎心速率監測圖形
B. 疼痛性陰道出血
C. 無痛性陰道出血
D. 凝血病變

正確答案：C. 無痛性陰道出血